Apnea-hypopnea index of less than 5 h-1 or greater than 30 h-1.

The above is a clinical trial exclusion criterion. Annotated with entity spans:
[Measurement: Apnea-hypopnea index] of [Value: less than 5 h-1 or greater than 30 h-1].